Clinical trial exclusion criterion:
An initial plasma potassium concentration of lower than 3.0 mmol/L

Annotated entities:
- Multiplier: "initial"
- Measurement: "plasma potassium concentration"
- Value: "lower than 3.0 mmol/L"